Clinical trial inclusion criterion:
Aged 18 years or older

Entity relations:
- Has_value("Aged", "18 years or older")